減數分裂中 DNA 重組是經由：
A. 雙股斷裂（double-strand break）重組
B. 單股斷裂（single-strand break）重組
C. 端粒（telomere）重組
D. 著絲粒（centromere）重組

正確答案：A. 雙股斷裂（double-strand break）重組